7. Adequate liver function as follows (10% deviation allowed)

The above is a clinical trial inclusion criterion. Annotated with entity spans:
[Parsing_Error: 7.] [Parsing_Error: Adequate liver function as follows (10% deviation allowed)]